Clinical trial inclusion criterion:
prospectively with an EDSS change of at least 1.0 points over the last two years, or

Annotated entities:
- Condition: "EDSS change"
- Value: "at least 1.0 points"
- Temporal: "over the last two years"